Community in a school district that is within the study area

The above is a clinical trial inclusion criterion. Annotated with entity spans:
Community in a [Visit: school district that is within the study area]